Clinical trial exclusion criterion:
severe renal impairment

Entity relations:
- Has_qualifier("renal impairment", "severe")